Hombre de 70 años, presenta disnea progresiva y tos no productiva de varios años de evolución. En la Rx de tórax se observan placas pleurales en pleura mediastínica y diafragmática. En la TC se confirman dichas placas apreciando además      la    presencia     de     afectación reticulonodulillar de predominio en campos inferiores. De entre las siguientes, ¿qué actitud recomendaría en primer lugar?
1. Completar su historia tabáquica.
2. Indagar sobre exposición ocupacional.
3. Solicitar analítica de sangre para descartar eosinofilia.
4. Hacer pruebas funcionales respiratorias completas.
5. Proponer una biopsia transbronquial.

Respuesta correcta: 2. Indagar sobre exposición ocupacional.